Clinical trial exclusion criterion:
history of gastro-intestinal inflammatory diseases

Annotated entities:
- Condition: "gastro-intestinal inflammatory diseases"